9. Living or planned travel outside Montreal (> 1h of driving) area during closed-loop procedures.

The above is a clinical trial exclusion criterion. Annotated with entity spans:
[Parsing_Error: 9.] [Non-query-able: Living or planned travel outside Montreal (> 1h of driving) area during closed-loop procedures.]